Clinical trial inclusion criterion:
150 cm of height or greater

Entity relations:
- Has_value("height", "150 cm or greater")